Clinical trial exclusion criterion:
Any significant co-morbidities, such as active heart, kidney, or liver diseases, accelerated or malignant hypertension, heart failure, severe anemia.

Annotated entities:
- Qualifier: "significant"
- Condition: "co-morbidities"
- Qualifier: "active"
- Condition: "diseases heart"
- Condition: "diseases kidney"
- Condition: "liver diseases"
- Qualifier: "malignant"
- Qualifier: "accelerated"
- Condition: "hypertension"
- Condition: "heart failure"
- Condition: "severe anemia"